下列何者是Cori cycle的主要代謝角色？
A. 將乳酸（lactate）由骨骼肌運送至肝臟
B. 將乳酸（lactate）由肝臟運送至骨骼肌
C. 將葡萄糖由骨骼肌運送至肝臟
D. 將葡萄糖與乳酸（lactate）由肝臟運送至骨骼肌

正確答案：A. 將乳酸（lactate）由骨骼肌運送至肝臟